Respecto a los cofactores enzimáticos:
1. Todos los enzimas los requieren para ser activos.
2. Su unión al enzima siempre es de tipo covalente.
3. No hay dos enzimas que utilicen el mismo cofactor.
4. Pueden ser iones metálicos.
5. Únicamente tienen función estructural.

Respuesta correcta: 4. Pueden ser iones metálicos.